Patients with an implantable device that may be susceptible to unintended interaction with the Inspire system.

The above is a clinical trial exclusion criterion. Annotated with entity spans:
[Non-query-able: Patients with an implantable device that may be susceptible to unintended interaction with the Inspire system].